La masa atómica del carbono es:
1. La masa de 6,02.1023 átomos de carbono, siendo todos ellos del isótopo 12C.
2. La masa de 6,022.1023 átomos de carbono, promediada según la abundancia natural de sus isótopos.
3. La doceava parte de la masa de un átomo de carbono del isótopo 12C.
4. La suma de la masa de 6 protones, 6 neutrones y 6 electrones.
5. La masa de 12 protones.

Respuesta correcta: 2. La masa de 6,022.1023 átomos de carbono, promediada según la abundancia natural de sus isótopos.